Clinical trial exclusion criterion:
History of cataracts or glaucoma or ocular hypertension

Entity relations:
- OR("cataracts", "glaucoma", "ocular hypertension")